Planned revascularization of any vessel within 30 days post-index procedure and/or of the target vessel(s) within 12 months post-procedure

The above is a clinical trial inclusion criterion. Annotated with entity spans:
[Mood: Planned] [Procedure: revascularization] of [Qualifier: any vessel] [Temporal: within 30 days post-index procedure] and/or [Qualifier: of the target vessel(s)] [Temporal: within 12 months post-procedure]